Clinical trial inclusion criterion:
RET fusion positive or FGFR2 fusion/other FGFR mutation Refractory solid tumor and/or specific sensitivity to Sunitinib by Avatar scan that has progressed following standard therapy or that has not responded to standard therapy or for which there is no standard therapy.

Annotated entities:
- Measurement: "RET fusion"
- Value: "positive"
- Qualifier: "FGFR2 fusion"
- Qualifier: "FGFR mutation"
- Qualifier: "Refractory"
- Condition: "solid tumor"
- Qualifier: "sensitivity"
- Drug: "Sunitinib"
- Non-query-able: "y Avatar scan that has progressed following standard therapy or that has not responded to standard therapy or for which there is no standard therapy"